Clinical trial exclusion criterion:
Allergy or intolerance to (N)OAC or clopidogrel.

Annotated entities:
- Condition: "Allergy"
- Condition: "intolerance"
- Drug: "(N)OAC"
- Drug: "clopidogrel"